Clinical trial exclusion criterion:
Cancer or other significant co-morbidities implying that the patient's condition is unstable.

Annotated entities:
- Condition: "Cancer"
- Condition: "co-morbidities"